大腸桿菌的DNA polymerase I本身不具有下列何種活性？
A. 含3'→5'外切酵素（exonuclease）活性
B. 含DNA gyrase活性
C. 含5'→3'DNA聚合酵素（polymerase）活性
D. 含5'→3'外切酵素（exonuclease）活性

正確答案：B. 含DNA gyrase活性